下列何者是氣狀污染物（例如一氧化碳）採集主要的原理？
A. 吸附
B. 熱力
C. 過濾
D. 衝擊力

正確答案：A. 吸附